Clinical trial inclusion criterion:
Aspartate transaminase (AST) less than or equal to 5 x ULN

Entity relations:
- Has_value("Aspartate transaminase (AST)", "less than or equal to 5 x ULN")